以標靶藥物（酪胺酸動力酶抑制劑，tyrosine kinase inhibitor）治療非小細胞肺癌，治療效果最主要的決定因素為何？
A. 細胞分類－肺腺癌
B. 性別－女性
C. 抽菸史－不抽菸者
D. 表皮成長因子受體（epidermal growth factor receptor）特定基因變異

正確答案：D. 表皮成長因子受體（epidermal growth factor receptor）特定基因變異